Clinical trial inclusion criterion:
Patients undergoing total knee arthroplasty under spinal anaesthesia

Annotated entities:
- Procedure: "total knee arthroplasty"
- Procedure: "spinal anaesthesia"